Current intake of antibiotics or end of antibiotic therapy <8 days before first IMP administration

The above is a clinical trial exclusion criterion. Annotated with entity spans:
[Temporal: Current] intake of [Drug: antibiotics] or [Multiplier: end of] [Procedure: antibiotic therapy] [Temporal: <8 days before first IMP administration]